Clinical trial exclusion criterion:
History of significant drug hypersensitivity or anaphylaxis.

Annotated entities:
- Condition: "drug hypersensitivity"
- Condition: "drug anaphylaxis"
- Qualifier: "significant"
- Subjective_judgement: "significant"
- Temporal: "History"